Clinical trial exclusion criteria:
Participation in another clinical trial at present or within 4 weeks of study entry. There may be exceptions at the discretion of the Investigator.
Has any progressive form of MS
Hypersensitivity to the active substance, or to any of the excipients of Lemtrada®
Medical, psychiatric, cognitive, or other conditions that, in the Investigator's opinion, compromise the patient's ability to understand the patient information, to give informed consent, to comply with the trial protocol, or to complete the study
Any disability acquired from trauma or another illness that could interfere with evaluation of disability due to MS
Major systemic disease or other illness that would, in the opinion of the Investigator, compromise patient safety or interfere with the interpretation of study results, e.g., current peptic ulcer disease or other conditions that may predispose to hemorrhage
Known bleeding disorder (e.g,. dysfibrinogenemia, factor IX deficiency, hemophilia, Von Willebrand's disease, disseminated intravascular coagulation (DIC), fibrinogen deficiency, or clotting factor deficiency)
Significant autoimmune disease including but not limited to immune cytopenias, rheumatoid arthritis, systemic lupus erythematosus, other connective tissue disorders, vasculitis, inflammatory bowel disease, severe psoriasis
History of malignancy, except basal skin cell carcinoma
Major psychiatric disorder that is not adequately controlled by treatment
Epileptic seizures that are not adequately controlled by Treatment
Active infection, e.g., deep-tissue infection, that the Investigator considers sufficiently serious to preclude study participation
In the Investigator's opinion, is at high risk for infection (e.g., indwelling catheter, dysphagia with aspiration, decubitus ulcer, history of prior aspiration pneumonia or recurrent urinary tract infection)
Seropositivity for human immunodeficiency virus (HIV)
Infection with hepatitis C Virus
Past or present hepatitis B infection (positive hepatitis B serology)
Active infection with human cytomegaly virus (HCMV), Epstein-Barr virus (EBV), varicella-zoster virus (VZV)
Latent tuberculosis unless effective anti-tuberculosis therapy has been completed, or active tuberculosis.
Invasive fungal infections in history and at present
Cervical cytology other than PAP I or PAP II (Papanicolaou) or cervical high risk human papillomavirus (HPV) positivity
Any other illness or infection (latent or active) that, in the Investigator's opinion, could be exacerbated by study medication
Differential blood count < lower limit of normal (LLN) at Screening
Confirmed platelet count < the LLN of the evaluating laboratory at Screening or documented at <100,000/µL within the past year on a sample without platelet clumping
Presence (i.e., above the ULN) of anti-thyroid stimulating hormone receptor antibodies (anti-TSHR) and anti-thyroid peroxidase antibody (anti-TPO)
Vaccination less than 6 weeks prior to treatment with Lemtrada.
Treatment with antineoplastic or immunosuppressive drugs within 8 weeks prior to study inclusion
Intolerance of pulsed corticosteroids, especially a history of steroid psychosis
Inability to undergo MRI with gadolinium administration
Of childbearing potential with a positive serum pregnancy test, pregnant or lactating
Female patients of childbearing potential: Unwilling to agree to use a reliable and acceptable contraceptive method (Pearl index <1) throughout the study period. These methods include: hormone releasing intrauterine device (IUD), hormonal-based contraception, surgical sterilization, abstinence, or double-barrier contraception (condom and occlusive cap [diaphragm or cervical cap combined with spermicide]).

Annotated entities:
- Competing_trial: "articipation in another clinical trial at present or within 4 weeks of study entry. There may be exceptions at the discretion of the Investigator"
- Value: "Participation"
- Condition: "MS"
- Qualifier: "progressive"
- Condition: "Hypersensitivity"
- Drug: "Lemtrada"
- Post-eligibility: "Medical, psychiatric, cognitive, or other conditions that, in the Investigator's opinion, compromise the patient's ability to understand the patient information, to give informed consent, to comply with the trial protocol, or to complete the study"
- Post-eligibility: "Any disability acquired from trauma or another illness that could interfere with evaluation of disability due to MS"
- Post-eligibility: "Major systemic disease or other illness that would, in the opinion of the Investigator, compromise patient safety or interfere with the interpretation of study results, e.g., current peptic ulcer disease or other conditions that may predispose to hemorrhage"
- Condition: "bleeding disorder"
- Condition: "dysfibrinogenemia"
- Condition: "factor IX deficiency"
- Condition: "hemophilia"
- Condition: "Von Willebrand's disease"
- Condition: "disseminated intravascular coagulation"
- Condition: "DIC"
- Condition: "fibrinogen deficiency"
- Condition: "clotting factor deficiency"
- Condition: "autoimmune disease"
- Condition: "immune cytopenias,"
- Condition: "rheumatoid arthritis,"
- Condition: "systemic lupus erythematosus"
- Condition: "connective tissue disorders"
- Condition: "vasculitis"
- Condition: "inflammatory bowel disease"
- Condition: "psoriasis"
- Qualifier: "severe"
- Condition: "malignancy"
- Negation: "except"
- Condition: "basal skin cell carcinoma"
- Condition: "psychiatric disorder"
- Qualifier: "Major"
- Qualifier: "adequately controlled"
- Negation: "not"
- Condition: "Epileptic seizures"
- Qualifier: "adequately controlled"
- Negation: "not"
- Condition: "infection"
- Qualifier: "Active"
- Condition: "deep-tissue infection"
- Observation: "risk for infection"
- Qualifier: "high"
- Device: "indwelling catheter"
- Condition: "dysphagia"
- Condition: "aspiration"
- Condition: "decubitus ulcer"
- Condition: "aspiration pneumonia"
- Condition: "urinary tract infection"
- Qualifier: "recurrent"
- Measurement: "human immunodeficiency virus"
- Measurement: "HIV"
- Value: "Seropositivity"
- Qualifier: "hepatitis C Virus"
- Condition: "Infection"
- Condition: "hepatitis B infection"
- Measurement: "hepatitis B serology"
- Value: "positive"
- Qualifier: "human cytomegaly virus"
- Qualifier: "HCMV"
- Qualifier: "Epstein-Barr virus"
- Qualifier: "EBV"
- Qualifier: "varicella-zoster virus"
- Qualifier: "VZV"
- Condition: "infection"
- Qualifier: "Active"
- Condition: "Latent tuberculosis"
- Negation: "unless"
- Procedure: "anti-tuberculosis therapy"
- Qualifier: "completed"
- Condition: "active tuberculosis"
- Condition: "fungal infections"
- Qualifier: "Invasive"
- Measurement: "Cervical cytology"
- Negation: "other"
- Qualifier: "PAP I"
- Qualifier: "PAP II"
- Qualifier: "Papanicolaou"
- Qualifier: "human papillomavirus"
- Qualifier: "cervical high risk"
- Qualifier: "HPV"
- Value: "positivity"
- Condition: "illness"
- Condition: "infection"
- Qualifier: "latent"
- Qualifier: "active"
- Temporal: "active"
- Non-representable: "in the Investigator's opinion"
- Qualifier: "exacerbated by study medication"
- Drug: "study medication"
- Measurement: "Differential blood count"
- Value: "< lower limit of normal (LLN)"
- Temporal: "at Screening"
- Measurement: "platelet count"
- Qualifier: "Confirmed"
- Value: "< the LLN of the evaluating laboratory"
- Temporal: "at Screening"
- Value: "<100,000/µL"
- Temporal: "within the past year"
- Qualifier: "sample without platelet clumping"
- Value: "above the ULN"
- Value: "Presence"
- Measurement: "anti-thyroid stimulating hormone receptor antibodies (anti-TSHR)"
- Measurement: "anti-thyroid peroxidase antibody (anti-TPO)"
- Drug: "Vaccination"
- Temporal: "less than 6 weeks prior to treatment with Lemtrada"
- Reference_point: "treatment with Lemtrada"
- Procedure: "treatment"
- Drug: "Lemtrada"
- Procedure: "Treatment"
- Drug: "antineoplastic drugs"
- Drug: "immunosuppressive drugs"
- Temporal: "within 8 weeks prior to study inclusion"
- Reference_point: "study inclusion"
- Drug: "pulsed corticosteroids"
- Temporal: "history of"
- Condition: "steroid psychosis"
- Condition: "Intolerance"
- Condition: "Inability to undergo MRI"
- Procedure: "MRI"
- Drug: "gadolinium"
- Mood: "Inability to"
- Person: "childbearing potential"
- Value: "positive"
- Measurement: "serum pregnancy test"
- Condition: "pregnant"
- Condition: "lactating"
- Person: "Female"
- Person: "childbearing potential"
- Pregnancy_considerations: "Unwilling to agree to use a reliable and acceptable contraceptive method (Pearl index <1) throughout the study period. These methods include: hormone releasing intrauterine device (IUD), hormonal-based contraception, surgical sterilization, abstinence, or double-barrier contraception (condom and occlusive cap [diaphragm or cervical cap combined with spermicide])"